Intention to become pregnant during the course of the study

The above is a clinical trial exclusion criterion. Annotated with entity spans:
[Pregnancy_considerations: Intention to become pregnant during the course of the study]